La estructura de una de las siguiente proteínas globulares está mayoritariamente en hélice alfa y carece de hoja beta:
1. Mioglobina.
2. Quimotripsina.
3. Ribonucleasa.
4. Lisozima.
5. Carboxipeptidasa.

Respuesta correcta: 1. Mioglobina.